What organ is associated with a Gleason pattern or Gleason Score?

The Gleason score is an important parameter for clinical outcome in prostate cancer patients.